Clinical trial exclusion criterion:
Patients who are pregnant or plan to become pregnant

Annotated entities:
- Pregnancy_considerations: "Patients who are pregnant or plan to become pregnant"